Clinical trial exclusion criterion:
17. Severe gastrointestinal disease.

Annotated entities:
- Parsing_Error: "17."
- Condition: "gastrointestinal disease"
- Qualifier: "Severe"
- Undefined_semantics: "Severe"
- Subjective_judgement: "Severe"